依據2011年的發表，美國、加拿大、英國之全科醫師（家庭醫師）占全部醫師的比例分別為31％、48％、68％。依此全科醫師比例來考量，有關這三個國家醫療花費分別占國內生產總值（Gross Domestic Product，GDP）比例的描述，下列何者正確？
A. 美國最高
B. 加拿大最高
C. 英國最高
D. 三個國家相似

正確答案：A. 美國最高